一位 35 歲女性，因車禍至急診處，左大腿非開放性股骨骨折。經急診住院，預計第二天進行骨科手術。清晨病人非常焦慮，發燒 38.7℃，心跳約 110/分，頸部甲狀腺約三度腫大。此時最好的檢查及治療不包括下列何者？
A. 儘快施行骨科手術
B. 抽血檢驗 T3、T4、TSH
C. 冰氈及退燒藥
D. beta blockers，corticosteroid 靜脈注射

正確答案：A. 儘快施行骨科手術